with use of any of the approved vascular closure devices

The above is a clinical trial inclusion criterion. Annotated with entity spans:
with use of any of the approved [Device: vascular closure devices]